Preexisting neurological deficits or peripheral neuropathy in the distribution of the sciatic nerve

The above is a clinical trial exclusion criterion. Annotated with entity spans:
Preexisting [Condition: neurological deficits] or [Condition: peripheral neuropathy] in the distribution of the [Qualifier: sciatic nerve]